Clinical trial exclusion criterion:
Gastroscopy planned at the same time.

Entity relations:
- Has_mood("Gastroscopy", "planned")
- Has_temporal("Gastroscopy", "at the same time")